Clinical trial exclusion criterion:
Subjects under 18 years of age

Entity relations:
- Has_value("age", "under 18 years")